Where can we find the protein dermcidin?

Dermcidin is a secretes protein found mainly in sweat but it is also found in serum.